La incontinencia urinaria afecta a una población importante de personas mayores. A la hora de aplicar diferentes terapias conductuales debemos tener en consideración que el entrenamiento de la vejiga urinaria o entrenamiento vesical:
1. Puede ser aplicado si el paciente está motivado y no tiene deterioro cognitivo ni físico.
2. Mejora la función de la vejiga en las personas con incontinencia funcional.
3. Ha demostrado ser eficaz en personas con déficits cognitivos.
4. Se define como el establecimiento de un esquema predecible de vaciado de la vejiga.
5. Se define como la mejoría de la función de la vejiga en cualquier tipo de incontinencia en personas con o sin deterioro cognitivo.

Respuesta correcta: 1. Puede ser aplicado si el paciente está motivado y no tiene deterioro cognitivo ni físico.